Women with any issue that, in the opinion of the investigator, would interfere with study participation or generating accurate study data

The above is a clinical trial exclusion criterion. Annotated with entity spans:
[Non-representable: Women with any issue that, in the opinion of the investigator, would interfere with study participation or generating accurate study data]